Clinical trial inclusion criterion:
Type 2 diabetes mellitus

Annotated entities:
- Condition: "Type 2 diabetes mellitus"